Clinical trial exclusion criterion:
Receipt of immune globulins, blood or blood-derived products in the past 3 months

Entity relations:
- Has_temporal("immune globulins", "in the past 3 months")
- OR("immune globulins", "blood", "blood-derived products")